Which methods are used for genome segmentation of gene expression data?

reversible jump markov chain monte carlo (rjmcmc) method